下列有關百日咳的敘述，那一項錯誤？
A. 常出現淋巴球增多現象
B. 台灣每年都有百日咳確定病例出現
C. 典型病例在肺部會出現哮鳴聲（wheezing）
D. 首選用藥是紅黴素等巨分子抗生素（macrolide antibiotics）

正確答案：C. 典型病例在肺部會出現哮鳴聲（wheezing）